43 年輕男性因社區感染大葉型肺炎（lobar pneumonia），痰液顯微鏡檢查顯示，有多核白血球及細胞內 革蘭氏陽性球菌，痰液培養結果只有口腔正常菌叢，下列何者是此病人最可能的致病菌：
A. 肺炎球菌（Streptococcus pneumoniae）
B. 披衣菌（Chlamydia）
C. 黴漿菌（Mycoplasma）
D. \ 克雷白氏肺炎桿菌（Klebsiella pneumoniae）

正確答案：A. 肺炎球菌（Streptococcus pneumoniae）